Mujer de raza caucásica de 28 años de edad, nulípara, acude para revisión ginecológica anual y solicitando la posibilidad de reducir el riesgo de cáncer de ovario dado que su madre falleció a causa de esta neoplasia a los 64 años de edad. En el interrogatorio detallado no se identifican otros antecedentes familiares de cáncer ovárico ni mamario. ¿Cuál de las siguientes estrategias es la más idónea para reducir el riesgo de cáncer de ovario en esta paciente?
1. Oclusión tubárica bilateral.
2. Salpingooforectomía          bilateral     por laparoscopia.
3. Administración diaria continuada de aspirina a baja dosis.
4. Aconsejarle que utilice lactancia artificial si queda gestante.
5. Tratamiento con anticonceptivos orales combinados.

Respuesta correcta: 5. Tratamiento con anticonceptivos orales combinados.